Clinical trial inclusion criterion:
barrier contraceptives (condom, diaphragm with spermicide)

Annotated entities:
- Device: "barrier contraceptives"
- Device: "condom"
- Device: "diaphragm"
- Qualifier: "with spermicide"